Clinical trial exclusion criterion:
Clear indication for specific duration of dual anti-platelet therapy

Entity relations:
- AND("Clear indication for specific duration", "dual anti-platelet therapy")